Clinical trial exclusion criterion:
3. Evidence or history of left-sided heart disease and/or clinically significant cardiac disease in which pulmonary hypertension is more likely WHO Group 2.

Annotated entities:
- Parsing_Error: "3."
- Temporal: "history"
- Condition: "left-sided heart disease"
- Condition: "cardiac disease"
- Qualifier: "clinically significant"
- Undefined_semantics: "clinically significant"
- Subjective_judgement: "clinically significant"
- Condition: "pulmonary hypertension"
- Measurement: "WHO Group"
- Value: "2"